Clinical trial exclusion criterion:
A self-reported history of loss of consciousness (greater than 10 minutes)

Annotated entities:
- Temporal: "history of loss of consciousness"
- Value: "greater than 10 minutes"
- Qualifier: "self-reported"